Un niño de 5 años presenta una erupción purpúrica con petequias, equimosis que aparecieron brutalmente junto con epistaxis y gingivorragias. Los datos del estudio de coagulación, fueron: Tiempo de hemorragia (Duke)>10 min.; PLT 20.000/mm3; netracción del coágulo nula; TP 13 seg (normal: 122 seg); TTPA 61 seg (normal: 602 seg); TT 18 seg (normal: 182 seg); Fibrinógeno 3,2 g/l (normal: 2-4 g/l); Autoanticuerpos plaquetarios positivos. Con estos datos puede tratarse de:
1. Hemofilia.
2. Enfermedad de Werlof.
3. Síndrome de Bernard Soulier.
4. Enfermedad von Willebrand.
5. Tromboastenia de Glanzmann.

Respuesta correcta: 2. Enfermedad de Werlof.